concomitant oral or i.v. therapy with strong CYP3A Inhibitors (e.g. ketoconazole, itraconazole, voriconazole, telithromycin, clarithromycin, nefazodone, ritonavir, saquinavir, nelfinavir, indinavir, atazanavir, grapefruit juice > 1 L/d), CYP3A substrates with narrow therapeutic indices (e.g. cyclosporine, quinidine), or strong CYP3A inducers (e.g. rifampin/rifampicin, phenytoin, carbamazepine, dexamethason, phenobarbital ) that cannot be safely discontinued

The above is a clinical trial inclusion criterion. Annotated with entity spans:
concomitant [Procedure: oral] or [Procedure: i.v. therapy] with [Drug: strong CYP3A Inhibitors] (e.g. [Drug: ketoconazole], [Drug: itraconazole], [Drug: voriconazole], [Drug: telithromycin], [Drug: clarithromycin], [Drug: nefazodone], [Drug: ritonavir], [Drug: saquinavir], [Drug: nelfinavir], [Drug: indinavir], [Drug: atazanavir], [Drug: grapefruit juice] [Multiplier: > 1 L/d]), [Drug: CYP3A substrates with narrow therapeutic indices] (e.g. [Drug: cyclosporine], [Drug: quinidine]), or [Drug: strong CYP3A inducers] (e.g. [Drug: rifampin]/[Drug: rifampicin], [Drug: phenytoin], [Drug: carbamazepine], [Drug: dexamethason], [Drug: phenobarbital] ) that cannot be safely discontinued